Clinical trial exclusion criterion:
Patients with renal disease (documented glomerular filtration rate < 60mL/min/1.73m2)

Entity relations:
- AND("renal disease", "glomerular filtration rate")
- Has_value("glomerular filtration rate", "< 60mL/min/1.73m2")